Known creatinine clearance <30 mL/minute or on hemodialysis.

The above is a clinical trial exclusion criterion. Annotated with entity spans:
Known [Measurement: creatinine clearance] [Value: <30 mL/minute] or on [Procedure: hemodialysis].